Clinical trial inclusion criterion:
Motor complete tetraplegia for at least 3 months

Entity relations:
- Has_qualifier("tetraplegia", "complete")
- Has_temporal("tetraplegia", "at least 3 months")